比較芬蘭型先天性腎病症候群（congenital nephrotic syndrome of Finnish type）與瀰漫性腎間膈細胞硬化（diffuse mesangial sclerosis），以下敘述何者錯誤？
A. 兩者主要均為自體隱性（autosomal recessive）遺傳
B. 前者基因突變位置在染色體 19，後者則是染色體 11 與 WT1 基因突變
C. 兩者母親之血中甲型胎兒蛋白（α-fetoprotein）均升高，且胎盤均變大
D. 兩者均常在 2～5 歲以前進入末期腎病，腎移植是唯一之治療

正確答案：C. 兩者母親之血中甲型胎兒蛋白（α-fetoprotein）均升高，且胎盤均變大